Clinical trial exclusion criterion:
Current treatment with weekly individual or group psychotherapy of any type targeted at depressive symptoms.

Annotated entities:
- Procedure: "psychotherapy"
- Qualifier: "group"
- Qualifier: "individual"
- Multiplier: "weekly"
- Condition: "depressive symptoms"